由於肝之生長，將腹腸繫膜（ventral mesentery）衍生成：
A. 鐮狀韌帶和小網膜
B. 鐮狀韌帶和大網膜
C. 小網膜和大網膜
D. 鐮狀韌帶和十二指腸繫膜

正確答案：A. 鐮狀韌帶和小網膜